Clinical trial inclusion criterion:
4. Ulcers that extend through the epidermis but not through the muscle, tendon, or bone (Stage II or III ulcers as defined by the IAET).

Entity relations:
- Has_negation("extend through the muscle", "not")
- AND("ulcers", "IAET")
- Has_value("IAET", "Stage II or III")
- Has_negation("extend through the tendon", "not")
- Has_negation("extend through the bone", "not")
- Subsumes("Ulcers", "ulcers")
- Has_qualifier("Ulcers", "extend through the epidermis")
- OR("extend through the epidermis", "extend through the tendon", "extend through the muscle", "extend through the bone")